下列免疫調節劑（immunomodulating agents）何者可使用於驅蟲治療外，其同時也可促進單核球，B 及 T 淋巴球細胞之功能？
A. levamisole
B. thalidomide
C. Bacille Calmett-Guérin
D. interferons

正確答案：A. levamisole